執行全身麻醉誘導前，應評估病人是否有困難通氣之可能，下列何者最不可能是預期困難通氣之病人？
A. 風濕性心臟病的病人
B. 唐氏綜合症的病人
C. 類風濕性關節炎的病人
D. 阻塞性睡眠呼吸中止症的病人

正確答案：A. 風濕性心臟病的病人